Which enzyme is deficient in Gaucher's disease?

Gaucher's disease is caused by deficient lysosomal glucocerebrosidase activity